El cambio de energía interna cuando se forma un mol de sólido a partir de los iones gaseosos a separación infinita, a presión atmosférica y a 0 K se denomina energía:
1. De formación.
2. De sublimación.
3. Reticular.
4. De condensación.
5. De licuefacción.

Respuesta correcta: 3. Reticular.